What is the main component of the Lewy bodies?

The main component of Lewy bodies is alpha-synuclein.